Clinical trial exclusion criterion:
Upper limb bites

Annotated entities:
- Qualifier: "Upper limb"
- Condition: "bites"